Clinical trial inclusion criterion:
Elective surgery for thoracic aneurysm

Entity relations:
- AND("Elective surgery", "thoracic aneurysm")